關於symmetric tonic neck reflex的敘述，下列何者正確？
A. 屈曲頭部時，上肢會彎曲，下肢也會彎曲
B. 屈曲頭部時，上肢會彎曲，下肢也會伸直
C. 伸直頭部時，上肢會伸直，下肢也會伸直
D. 伸直頭部時，上肢會彎曲，下肢也會伸直

正確答案：B. 屈曲頭部時，上肢會彎曲，下肢也會伸直